Clinical trial inclusion criterion:
Ambulatory status (outpatient) at time of consent

Annotated entities:
- Visit: "Ambulatory status"
- Visit: "outpatient"
- Temporal: "at time of consent"